List components of the CRSP/Med complex.

Mediator of RNA polymerase II transcription subunit 7
Mediator of RNA polymerase II transcription subunit 14
Mediator of RNA polymerase II transcription subunit 17
Mediator of RNA polymerase II transcription subunit 23
Mediator of RNA polymerase II transcription subunit 24
Mediator of RNA polymerase II transcription subunit 26
Mediator of RNA polymerase II transcription subunit 27